Patients with severe organ dysfunction or failure

The above is a clinical trial exclusion criterion. Annotated with entity spans:
Patients with [Qualifier: severe] [Condition: organ dysfunction] or failure